Clinical trial exclusion criterion:
Liver enzymes equal or more than 1.5 times the upper limit of normal

Entity relations:
- Has_value("Liver enzymes", "equal or more than 1.5 times the upper limit of normal")